Willing to receive three doses of an FDA-approved Hepatitis B vaccine

The above is a clinical trial inclusion criterion. Annotated with entity spans:
[Post-eligibility: Willing to receive three doses of an FDA-approved Hepatitis B vaccine]